Receiving steroids at the time of transplantation or likely to need steroids after transplantation.

The above is a clinical trial exclusion criterion. Annotated with entity spans:
[Procedure: Receiving] [Drug: steroids] [Temporal: at the time of transplantation] or [Mood: likely to need] [Drug: steroids] [Temporal: after transplantation].